可被鉻鹽溶液染上的細胞是：
A. 腎上腺皮質細胞（adrenocortical cells）
B. 腎上腺髓質細胞（adrenomedullary cells）
C. 副甲狀腺主細胞（chief cells of parathyroid gland）
D. 副甲狀腺嗜酸性細胞（oxyphil cells of parathyroid gland）

正確答案：B. 腎上腺髓質細胞（adrenomedullary cells）